Which is the main reason for the increase in the incidence of cryptococcal disease?

It is an increasing cause of infection in immunosuppressed patients, most notably those with HIV infection. The incidence of infection with Cryptococcus neoformans has increased four-fold in the last decade.